What laboratory abnormalities are commonly seen in patients with COVID-19?

Common laboratory abnormalities among patients with COVID-19 include:

1. Elevated inflammatory markers (e.g., ferritin, C-reactive protein, and erythrocyte sedimentation rate).
2. Elevated aminotransaminase levels (i.e., AST, ALT).
3. Elevated lactate dehydrogenase (LDH) levels.
4. Lymphopenia, leucocytosis.

Abnormalities in coagulation testing (e.g., increased D-Dimers, decreased platelets), elevated procalcitonin levels, and elevated troponin levels have also been reported. The degree of these abnormalities tends to correlate with disease severity.